Participants must be considered by their physician eligible to receiving the IRD regimen.

The above is a clinical trial inclusion criterion. Annotated with entity spans:
Participants must be considered by their physician [Mood: eligible to] receiving the [Procedure: IRD regimen].